Clinical trial inclusion criterion:
New or presumed new significant ST-T wave changes

Annotated entities:
- Qualifier: "significant"
- Multiplier: "New"
- Multiplier: "presumed new"
- Condition: "ST-T wave changes"